Uno de los siguientes elementos de la terapia cognitivo-conductual para el trastorno de pánico (o trastorno de angustia) ha sido especialmente cuestionado y su utilidad se ha minimizado. Indique cuál:
1. Exposición interoceptiva.
2. Educación.
3. Exposición en vivo.
4. Entrenamiento en respiración.
5. Reestructuración cognitiva.

Respuesta correcta: 4. Entrenamiento en respiración.